親子旅行團回國後，有 3 名參加的學齡前孩童先後因出血性腹瀉至醫院就醫。醫院在 3 名孩童的糞便中均分離出 O157:H7 血清型大腸桿菌（Escherichia coli）。下列何者是最常見的嚴重併發症？
A. 腦膜炎（meningitis）
B. 敗血症（septicemia）
C. 溶血性尿毒症（hemolytic uremic syndrome）
D. 橫紋肌溶解症（rhabdomyolysis）

正確答案：C. 溶血性尿毒症（hemolytic uremic syndrome）